Severe heart, lung and central nervous system disorders.

The above is a clinical trial inclusion criterion. Annotated with entity spans:
[Qualifier: Severe] [Condition: heart], [Condition: lung] and c[Condition: entral nervous system disorders].